What drug, used to treat rheumatoid arthritis, is an interleukin-1 receptor antagonist?

Anakinra is an anti-IL-1RA targeting IL-1β with a central role in the occurrence of auto-inflammatory diseases